La radiación ultravioleta cambia la estructura del ADN por:
1. Ruptura de enlaces fosfodiéster.
2. Desaminación de las bases nitrogenadas.
3. Despurinización.
4. Formación de anillos ciclobutílicos de pirimidinas.
5. Hidroxilación de las bases nitrogenadas.

Respuesta correcta: 4. Formación de anillos ciclobutílicos de pirimidinas.